Clinical trial inclusion criterion:
All patients must have diagnostic laparoscopy with diagnostic washings for cytology; both cytology positive and negative patients are eligible for enrolment, but only cytology negative patients will be included in the primary analyses; gross peritoneal disease is not eligible

Annotated entities:
- Procedure: "laparoscopy"
- Qualifier: "diagnostic"
- Procedure: "washings for cytology"
- Measurement: "cytology"
- Value: "positive"
- Value: "negative"
- Non-query-able: "nly cytology negative patients will be included in the primary analyses; gross peritoneal disease is not eligible"